8. Persistent chronic clinically significant non-hematological toxicities from prior treatment must be ≤Grade 1.

The above is a clinical trial inclusion criterion. Annotated with entity spans:
8. Persistent chronic [Qualifier: clinically significant] [Qualifier: non-hematological] [Condition: toxicities] [Qualifier: from prior treatment] must be [Qualifier: ≤Grade 1].